有關 solitary rectal ulcer syndrome 之敘述，下列何者錯誤？
A. 一定要有肛門口近端 4 到 12 公分處的 anterior rectal wall ulcer 才算
B. 常發生在長期便祕，需用力解便之年輕女性
C. 影像學診斷常依賴 defecography 之 rectal prolapse、internal prolapse 及 paradoxical puborectalis syndrome 等
D. 病理組織學上與直腸癌或克隆氏症（Crohn's disease）的鑑別診斷並不難

正確答案：A. 一定要有肛門口近端 4 到 12 公分處的 anterior rectal wall ulcer 才算